Las siglas ECM, en el etiquetado de medicamentos, tiene el significado de:
1. Medicamento de Competencia Europea [siglas en inglés].
2. Envase de Comercialización para Mayoristas.
3. Especial Control Médico.
4. Envase de Control Mecánico.
5. Especialidad de Consumo Masivo.

Respuesta correcta: 3. Especial Control Médico.